Clinical trial exclusion criterion:
History of hypersensitivity to EACA

Annotated entities:
- Condition: "hypersensitivity"
- Drug: "EACA"